Cuál de las siguientes hebras del ADN tiene la misma secuencia de nucleótidos (excepto el cambio de T por U) que su transcrito primario:
1. La hebra codificante.
2. La hebra molde.
3. La hebra adelantada.
4. La hebra retardada.
5. Ninguna.

Respuesta correcta: 1. La hebra codificante.